Clinical trial inclusion criterion:
Sexually active

Annotated entities:
- Observation: "Sexually active"